Clinical trial exclusion criterion:
On any thoracic surgery waiting list.

Annotated entities:
- Procedure: "thoracic surgery"
- Observation: "thoracic surgery waiting list"